Clinical trial inclusion criterion:
Subjects who are geographically stable and available for follow-up at the study center for the length of the study

Annotated entities:
- Person: "geographically stable"
- Observation: "available for follow-up"
- Visit: "at the study center"
- Temporal: "for the length of the study"